Clinical trial exclusion criterion:
Anemia (hematocrit < 27%)

Entity relations:
- Has_value("hematocrit", "< 27%")
- AND("Anemia", "hematocrit")